La reactividad de ROH con los metales alcalinos para dar alcóxidos e hidrogeno sigue el orden:
1. Terciario>secundario>primario>metilo.
2. Metilo> primario>secundario>terciario.
3. Metilo>primario>terciario>secundario.
4. Metilo>terciario>secundario>primario.

Respuesta correcta: 2. Metilo> primario>secundario>terciario.